Clinical trial exclusion criterion:
previous treated dupuytrens contracture same hand

Entity relations:
- Has_qualifier("dupuytrens contracture", "same hand")
- Has_qualifier("dupuytrens contracture", "treated")
- Has_temporal("dupuytrens contracture", "previous")